Any treatment directed against active tuberculosis within 6 months preceding initiation of study drugs.

The above is a clinical trial exclusion criterion. Annotated with entity spans:
Any [Procedure: treatment] directed against [Qualifier: active] [Condition: tuberculosis] [Temporal: within 6 months preceding initiation of study drugs].